Clinical trial inclusion criterion:
Minimum of 24 permanent teeth.

Entity relations:
- Has_multiplier("permanent teeth", "Minimum of 24")